Clinical trial exclusion criterion:
Be allergic or have contraindications to nitroglycerin or other nitrates.

Entity relations:
- AND("allergic", "nitroglycerin")
- OR("nitroglycerin", "nitrates")
- OR("allergic", "contraindications")